Unavailable for followup

The above is a clinical trial exclusion criterion. Annotated with entity spans:
[Post-eligibility: Unavailable for followup]